Clinical trial exclusion criterion:
Patients with findings of hemorrhage

Annotated entities:
- Condition: "hemorrhage"